Ladybird homeobox (Lbx) transcription factors regulate the development of what body systems/organs?

Ladybird homeobox (Lbx) transcription factors have crucial functions in muscle and nervous system development in many animals